Clinical trial exclusion criterion:
HCC or other malignancy within 3 years.

Annotated entities:
- Condition: "HCC"
- Condition: "malignancy"
- Temporal: "within 3 years"